Clinical trial exclusion criterion:
known sensitivity to components of the Truvada® formulation

Entity relations:
- AND("sensitivity", "Truvada")